Clinical trial exclusion criterion:
Concurrently participating in another clinical study, at any time during the study period, in which the subject has been or will be exposed to an investigational or a non-investigational vaccine/product

Annotated entities:
- Temporal: "Concurrently"
- Observation: "participating in clinical study"
- Temporal: "at any time during the study period"
- Reference_point: "the study period"
- Drug: "vaccine"
- Drug: "product"
- Qualifier: "investigational"
- Qualifier: "non-investigational"